Clinical trial exclusion criterion:
A history of bleeding tendency;

Annotated entities:
- Condition: "bleeding tendency"
- Temporal: "history"